Feasibility of patch testing.

The above is a clinical trial inclusion criterion. Annotated with entity spans:
[Mood: Feasibility of] [Post-eligibility: patch testing].